The patient has participated in other experimental therapy studies within 30 days

The above is a clinical trial exclusion criterion. Annotated with entity spans:
[Non-query-able: The patient has participated in other experimental therapy studies within 30 days]